¿Cuál de los siguientes es un síntoma del denominado “pensamiento grupal”?:
1. Ilusión de invulnerabilidad.
2. Disonancia cognitiva.
3. Ignorancia pluralista.
4. Correlación ilusoria.
5. Conversión.

Respuesta correcta: 1. Ilusión de invulnerabilidad.